hypoglycemia SE;psychogenic SE;any other pseudo-SE

The above is a clinical trial exclusion criterion. Annotated with entity spans:
[Condition: hypoglycemia SE];[Condition: psychogenic SE];any other [Condition: pseudo-SE]